下列何者用來治療白內障手術後產生的水晶體後囊混濁（posterior capsular opacity）？
A. 銣雅鉻雷射（Nd:YAG laser)
B. 超音波晶體乳化術（phacoemulsification)
C. 人工水晶體
D. 人工玻璃體

正確答案：A. 銣雅鉻雷射（Nd:YAG laser)